Clinical trial exclusion criteria:
diagnosed advanced heart, kidney or liver failure
benign prostatic hyperplasia
prostatic carcinoma
frequent urinary tract infections
non-type 1 diabetes mellitus

Annotated entities:
- Condition: "advanced heart failure"
- Condition: "kidney failure"
- Condition: "liver failure"
- Condition: "benign prostatic hyperplasia"
- Condition: "prostatic carcinoma"
- Multiplier: "frequent"
- Condition: "urinary tract infections"
- Condition: "non-type 1 diabetes mellitus"